Clinical trial exclusion criterion:
CYP2C8 substrates such as thiazolidinediones (glitazones) and select statins (because of expected inhibition of the metabolism of CYP2C8 substrates) by venetoclax

Entity relations:
- Subsumes("thiazolidinediones", "glitazones")
- Has_qualifier("statins", "select")
- Subsumes("CYP2C8 substrates", "thiazolidinediones")
- OR("CYP2C8 substrates", "statins")